Clinical trial exclusion criterion:
Ischemic heart disease

Annotated entities:
- Condition: "Ischemic heart disease"